Clinical trial exclusion criterion:
Cardiac or neurologic active medical condition, including past CVA/TIA (Cardiovascular Accident/Transient Ischemic Attack) or any other unstable medical condition.

Entity relations:
- Subsumes("CVA", "Cardiovascular Accident")
- Subsumes("TIA", "Transient Ischemic Attack")
- Has_temporal("CVA", "past")
- Has_qualifier("medical condition", "unstable")
- Subsumes("Cardiac active medical condition", "CVA")
- OR("Cardiac active medical condition", "neurologic active medical condition")
- OR("CVA", "TIA")
- OR("Cardiovascular Accident", "Transient Ischemic Attack")
- OR("CVA", "medical condition")